Clinical trial inclusion criterion:
Not using medically approved contraception (including abstinence) if female and of childbearing age

Annotated entities:
- Negation: "Not"
- Qualifier: "medically approved"
- Procedure: "contraception"
- Procedure: "abstinence"
- Person: "female"
- Person: "childbearing age"
- Observation: "age"
- Value: "childbearing"